某醫師隨機抽了 50 人的住院資料，每一病人測量「年齡」及「疼痛忍受度」，年齡記錄方法如下：1為 20-25 歲，2為 26-45 歲，3為 46-65 歲，4為 66 歲以上。疼痛忍受度則以 0 到 10 分表示，0 為最不痛，10 為最痛。若想看「年齡」和「疼痛忍受度」之間的關係，下列統計方法何者最適當？
A. 卡方檢定（Chi-square test）
B. Spearman相關（Spearman's correlation）
C. 獨立t檢定（Two-sample t test）
D. Wilcoxon符號等級檢定（Wilcoxon signed-rank test）

正確答案：B. Spearman相關（Spearman's correlation）